No counter indications according to the Medikinet pill.

The above is a clinical trial exclusion criterion. Annotated with entity spans:
[Non-query-able: No counter indications according to the Medikinet pill].